Clinical trial inclusion criterion:
capable of providing informed consent

Annotated entities:
- Informed_consent: "capable of providing informed consent"